Clinical trial inclusion criteria:
treatment-naive patients with lymphoma
HBsAg negative/HBcAb positive/hepatitis B virus DNA negative at baseline
treated with chemotherapy and/or immunosuppressive therapy
life expectancy of more than 3 months

Annotated entities:
- Observation: "treatment-naive"
- Condition: "lymphoma"
- Measurement: "HBsAg"
- Value: "negative"
- Measurement: "HBcAb"
- Value: "positive"
- Measurement: "hepatitis B virus DNA"
- Value: "negative"
- Temporal: "at baseline"
- Procedure: "chemotherapy"
- Procedure: "immunosuppressive therapy"
- Observation: "life expectancy"
- Temporal: "more than 3 months"